Age >/= 18 years

The above is a clinical trial inclusion criterion. Annotated with entity spans:
[Person: Age] [Value: >/= 18 years]